肺炎鏈球菌（Streptococcus pneumoniae）可用下列何種方法鑑定？
A. 尿	素	酶試驗（urease test）
B. 膽汁溶解試驗（bile solubility test）
C. 錫克氏試驗（Schick test）
D. 氧	化	酶試驗（oxidase test）

正確答案：B. 膽汁溶解試驗（bile solubility test）